病毒複製的第一步為病毒蛋白質與感染細胞表面之接受器認識（recognition）；Rhinovirus 14 之細胞接受器為：
A. 細胞間黏附分子（Intracellular adhension molecule, ICAM-1）
B. 細胞表面之唾液酸（sialic acid）
C. 細胞表面之 CD4 分子
D. C3 補體受器

正確答案：A. 細胞間黏附分子（Intracellular adhension molecule, ICAM-1）